Clinical trial exclusion criterion:
Current haemodialysis or peritoneal dialysis

Entity relations:
- Has_temporal("haemodialysis", "Current")
- OR("haemodialysis", "peritoneal dialysis")